French Native language

The above is a clinical trial inclusion criterion. Annotated with entity spans:
[Observation: French Native language]